clinically significant bleeding within the 30 days prior to the scheduled procedure;

The above is a clinical trial exclusion criterion. Annotated with entity spans:
[Qualifier: clinically significant] [Condition: bleeding] [Temporal: within the 30 days prior to the scheduled procedure];